隱斜視（heterophoria）的診斷一般須靠下列何種檢查，才能確定？
A. cover-uncover test
B. alternate cover test
C. prism cover test
D. prism reflex test（krimsky）

正確答案：A. cover-uncover test